Clinical trial exclusion criterion:
Patient with health problems or a skin disease precluding continuous subcutaneous infusion

Entity relations:
- Has_negation("continuous subcutaneous infusion", "precluding")
- AND("health problems", "continuous subcutaneous infusion")
- OR("health problems", "skin disease")